Clinical trial exclusion criterion:
Breastfeeding women unwilling to temporarily stop breastfeeding

Annotated entities:
- Non-representable: "Breastfeeding women unwilling to temporarily stop breastfeeding"